Clinical trial exclusion criterion:
Serious medical or psychiatric illness that would interfere with the ability to adhere to study requirements

Entity relations:
- Has_qualifier("medical illness", "Serious")
- Has_qualifier("medical illness", "would interfere with the ability to adhere to study requirements")
- OR("medical illness", "psychiatric illness")